下列何者不是理想的腎臟捐贈者？
A. 腎功能正常者
B. 同時罹患原發性腦瘤的病人
C. 出現全身性病毒或細菌感染
D. 梅毒、肝炎檢查正常者

正確答案：C. 出現全身性病毒或細菌感染